Un varón de 52 años presenta de forma aguda un síndrome confusional, paresia de ambos músculos rectos externos oculares y ataxia de la marcha pensaría en
1. Encefalopatía hiperglucémica.
2. Encefalopatía de Korsakoff.
3. Infarto cerebeloso.
4. Administrar inmediatamente tiamina.
5. Intoxicación por plomo.

Respuesta correcta: 4. Administrar inmediatamente tiamina.